What is the purpose of the Unique Connectivity of Uncharged Compounds (UC2) search tool?

The Unique Connectivity of Uncharged Compounds (UC2) search tool uses unique connectivity of uncharged compounds for metabolite annotation by database searching in mass spectrometry-based metabolomics. The UC2 search tool is available at http://unc.bioqrator.org/UC2/.